Clinical trial exclusion criterion:
History of pancreatitis

Annotated entities:
- Condition: "pancreatitis"
- Temporal: "History of"